足月新生兒未施打維他命 K，較會發生下列那一種情況？
A. 造成第五因子（factor V）缺乏
B. 造成前凝血酵素時間（prothrombin time）延長
C. 若發生出血性疾病，大多不會在出生後五天內發生
D. 若發生出血性疾病，餵食牛奶（cow's milk）者比餵食母奶（breast milk）者嚴重

正確答案：B. 造成前凝血酵素時間（prothrombin time）延長